¿Cuál de los siguientes músculos es un ejemplo de abductor?
1. Pectoral mayor.
2. Trapecio.
3. Dorsal ancho.
4. Recto anterior del abdomen.
5. Deltoides.

Respuesta correcta: 5. Deltoides.